La terapia de focalización para las alucinaciones auditvas de Betall, Haddock y Slade (1994) utiliza diferentes estrategias terapéuticas ¿Cuál de las siguientes opciones NO se contempla en el modelo de la terapia de focalización?:
1. Se le pide al paciente que se fije y describa las características físicas de sus voces (por ejemplo tono, intensidad, localización).
2. Se le pide al paciente que observe la relación ente el contenido de las alucinaciones y preocupaciones actuales.
3. Se le pide al paciente que observe la relación entre el contenido de las alucinaciones y sus experiencias vitales.
4. Se le pide al paciente que neutralice el contenido de sus voces centrándose en sus sensaciones fisiológicas propioceptivas.
5. Se le pide que observe sus reacciones ante las voces y, en particular, a sus creencias sobre ellas.

Respuesta correcta: 4. Se le pide al paciente que neutralice el contenido de sus voces centrándose en sus sensaciones fisiológicas propioceptivas.